Clinical trial inclusion criterion:
Participant and/or parent/legal guardian willing and able to give informed consent for participation in the study.

Annotated entities:
- Informed_consent: "Participant and/or parent/legal guardian willing and able to give informed consent for participation in the study"